Clinical trial inclusion criterion:
1. Age: 18 years and older.

Entity relations:
- Has_value("Age", "18 years and older")